下列何種肺氣腫（emphysema）與α1-antitrypsin缺乏最有相關？
A. 中央腺泡型肺氣腫（centriacinar emphysema）
B. 泛腺泡型肺氣腫（panacinar emphysema）
C. 旁中隔型肺氣腫（paraseptal emphysema）
D. 不規則型肺氣腫（irregular emphysema）

正確答案：B. 泛腺泡型肺氣腫（panacinar emphysema）